PaCO2 < 50mm Hg

The above is a clinical trial inclusion criterion. Annotated with entity spans:
[Measurement: PaCO2] [Value: < 50mm Hg]